Clinical trial inclusion criterion:
critical limb ischemia (Rutherford class 4-6)

Entity relations:
- Has_value("Rutherford class", "4-6")
- Has_qualifier("limb ischemia", "critical")
- Subsumes("critical", "Rutherford class")